Clinical trial inclusion criterion:
11. Subjects should be either sexually inactive (abstinent) or agree to use a barrier method with spermicide in the event of sexual activity throughout the study period

Entity relations:
- Subsumes("sexually inactive", "sexually abstinent")
- Has_context("barrier method with spermicide", "agree to use")
- OR("sexually inactive", "barrier method with spermicide")